Clinical trial exclusion criterion:
Take any Alpha-Methyldopa, Clonodine, Other Alpha-2 Adrenergic Agonist

Annotated entities:
- Drug: "Alpha-Methyldopa"
- Drug: "Clonodine"
- Qualifier: "Other"
- Drug: "Alpha-2 Adrenergic Agonist"